Clinical trial exclusion criterion:
Heart Team assessment of operability (the heart team considers the patient to be a good surgical candidate).

Entity relations:
- AND("heart team considers the patient to be a good surgical candidate", "Heart Team assessment of operability")